Clinical trial inclusion criterion:
1. Women and men ages 18 years and over.

Annotated entities:
- Person: "Women"
- Person: "men"
- Person: "ages"
- Value: "18 years and over"
- Grammar_Error: "and"